Clinical trial exclusion criterion:
Bone age reading more than 14.0 years

Entity relations:
- Has_value("Bone age", "more than 14.0 years")